Current unstable angina.

The above is a clinical trial exclusion criterion. Annotated with entity spans:
[Temporal: Current] [Condition: unstable angina].